1) preoperative diagnosis of delirium or dementia; 2) MMSE score of = 20 out of 30 on preoperative testing (more than mild cognitive impairment) or delirium on preoperative CAM testing; 3) language barriers that would preclude testing; 4) preoperative steroid use within 3 days of surgery; or 5) anticipation of postoperative intubation.

The above is a clinical trial exclusion criterion. Annotated with entity spans:
[Line: 1) preoperative diagnosis of delirium or dementia;] [Line: 2) MMSE score of = 20 out of 30 on preoperative testing (more than mild cognitive impairment) or delirium on preoperative CAM testing;] [Line: 3) language barriers that would preclude testing;] [Line: 4) preoperative steroid use within 3 days of surgery;] or [Line: 5) anticipation of postoperative intubation.]